下列何種激素會增加鈉離子的排泄？
A. aldosterone
B. renin
C. atrial natriuretic peptide
D. angiotensin

正確答案：C. atrial natriuretic peptide